La interrupción del flujo aéreo nasobucal acompañado por esfuerzos respiratorios musculares que no son suficientes para abrir las vías aéreas superiores, constituye:
1. El principal efecto secundario del electroshock.
2. Un síntoma del síndrome de abstinencia de la heroína.
3. Un efecto del síndrome amnésico.
4. El episodio apnéico.
5. La fase aguda de la fobia social.

Respuesta correcta: 4. El episodio apnéico.